Clinical trial exclusion criterion:
Self-identified history of hypoglycemia

Annotated entities:
- Condition: "hypoglycemia"
- Temporal: "history"
- Qualifier: "Self-identified"